Clinical trial exclusion criterion:
Currently requiring chronic dialysis

Entity relations:
- Has_temporal("requiring chronic dialysis", "Currently")